下列何者為使用 beta-adrenergic agonist 安胎之可能併發症？
A. pulmonary edema
B. hypoglycemia
C. deep vein thrombosis
D. hypertension

正確答案：A. pulmonary edema